acute coronary syndrome within the 90 days prior to the scheduled procedure,

The above is a clinical trial exclusion criterion. Annotated with entity spans:
[Condition: acute coronary syndrome] [Temporal: within the 90 days prior to the scheduled procedure],